Clinical trial exclusion criterion:
Have not received influenza vaccination in the past or cannot be vaccinated due to previous severe reaction to influenza vaccine, egg, latex, or thimerosol allergies, or refusal of vaccination

Annotated entities:
- Negation: "not"
- Procedure: "influenza vaccination"